Clinical trial exclusion criterion:
Not sexually active with a male partner

Annotated entities:
- Negation: "Not"
- Observation: "sexually active"
- Qualifier: "male partner"